Clinical trial inclusion criteria:
Age 10 to 65 years
Temperature less than 100.4 F
Normal neurologic exam and normal mental status

Annotated entities:
- Person: "Age"
- Value: "10 to 65 years"
- Measurement: "Temperature"
- Value: "less than 100.4 F"
- Procedure: "neurologic exam"
- Value: "Normal"
- Value: "normal"
- Measurement: "mental status"